Las distintas subpoblaciones de linfocitos T efectores secretan diferentes citoquinas. ¿Cuál de las siguientes afirmaciones es FALSA?:
1. Los linfocitos TH1 secretan IL-3.
2. Los linfocitos TH17 secretan IL-6.
3. Los linfocitos TH2 secretan IFN-gamma.
4. Los linfocitos T citotóxicos secretan TNFalfa.
5. Los linfocitos T reguladores secretan IL-10.

Respuesta correcta: 3. Los linfocitos TH2 secretan IFN-gamma.